表皮（Epidermis）是屬於：
A. 單層柱狀上皮（Simple columnar epithelium）
B. 移形上皮（Transitional epithelium）
C. 偽複層柱狀上皮（Pseudostratified columnar epithelium）
D. 角質化複層扁平上皮（Keratinized stratified squamous epithelium）

正確答案：D. 角質化複層扁平上皮（Keratinized stratified squamous epithelium）